Clinical trial exclusion criterion:
Current unstable angina.

Annotated entities:
- Condition: "unstable angina"
- Temporal: "Current"